Clinical trial exclusion criterion:
Severe hypotension [resting SBP less than (<) 90mmHg, or resting DBP<50mmHg].

Annotated entities:
- Condition: "hypotension"
- Qualifier: "Severe"
- Measurement: "SBP"
- Value: "less than 90mmHg"
- Qualifier: "resting"
- Qualifier: "resting"
- Measurement: "DBP"
- Value: "<50mmHg"